Clinical trial exclusion criterion:
(1) Menopause (non-therapy-induced amenorrhea of more than 12 months) Female

Entity relations:
- Has_multiplier("amenorrhea", "more than 12 months")
- Has_qualifier("amenorrhea", "non-therapy-induced")
- Subsumes("Menopause", "amenorrhea")